Clinical trial exclusion criterion:
Uncontrolled psychiatric disorder

Annotated entities:
- Qualifier: "Uncontrolled"